Best-corrected visual acuity < 20/200 (Snellen equivalent);

The above is a clinical trial exclusion criterion. Annotated with entity spans:
[Measurement: Best-corrected visual acuity] [Value: < 20/200] (Snellen equivalent);